Clinical trial exclusion criterion:
Patients with thyroid pathology, the treatment of which has not been stabilized for at least three months.

Entity relations:
- AND("thyroid pathology", "treatment")
- Has_qualifier("treatment", "stabilized")
- Has_negation("stabilized", "not")
- Has_temporal("treatment", "at least three months")